Clinical trial inclusion criterion:
Perimenopausal women complaining of abnormal uterine bleeding (menorrhagia, metrorrhagia, polymenorrhoea or polymenorrhagia) without local gynecological cause.

Entity relations:
- Has_negation("local gynecological cause", "without")
- Subsumes("abnormal uterine bleeding", "menorrhagia")
- AND("abnormal uterine bleeding", "local gynecological cause")
- OR("menorrhagia", "polymenorrhagia", "metrorrhagia", "polymenorrhoea")